¿Qué tipo de organismo patógeno es el causante de la clamidiasis?:
1. Ectoparásito.
2. Hongo.
3. Bacteria.
4. Protozoo.

Respuesta correcta: 3. Bacteria.